An Eastern Cooperative Oncology Group (ECOG) performance status of 0 or 1

The above is a clinical trial inclusion criterion. Annotated with entity spans:
An [Measurement: Eastern Cooperative Oncology Group] ([Measurement: ECOG]) performance status of [Value: 0 or 1]